Clinical trial inclusion criterion:
scheduled for urologic or orthopedic procedure necessitating intrathecal morphine

Entity relations:
- Has_qualifier("morphine", "intrathecal")
- AND("urologic procedure", "morphine")
- OR("urologic procedure", "orthopedic procedure")